Clinical trial inclusion criterion:
premenopausal women

Annotated entities:
- Condition: "premenopausal"
- Person: "women"